Clinical trial inclusion criterion:
Age: ≥18 and ≤ 60

Annotated entities:
- Person: "Age"
- Value: "≥18 and ≤ 60"